Clinical trial exclusion criterion:
designated ASA physical status 4 or above

Annotated entities:
- Measurement: "ASA physical status"
- Value: "4 or above"